Clinical trial inclusion criterion:
Primary psychiatric diagnosis of Major Depressive Disorder, without psychotic features, confirmed via SCID-IV structured diagnostic interview.

Entity relations:
- Has_qualifier("Major Depressive Disorder", "Primary")
- Has_negation("psychotic features", "without")
- AND("Major Depressive Disorder", "psychotic features")